一位 30 歲男性病人，多次測量血壓，兩側上臂為 160/50 至 150/40 mmHg 之間，兩側下肢為 170/40 至 160/40 mmHg 之間。心臟聽診有第三級舒張期雜音（Gr 3/6 diastolic blowing murmur）。下列那一種病症最有可能？
A. 主動脈狹縮（Coarctation of aorta）
B. 腎動脈狹窄（Renal artery stenosis）
C. 本態性高血壓（Essential hypertension）
D. 主動脈瓣膜閉鎖不全（Aortic regurgitation）

正確答案：D. 主動脈瓣膜閉鎖不全（Aortic regurgitation）